Alkaptonuria 與下列何種酵素缺陷有關？
A. Branched-chain α-keto acid dehydrogenase complex
B. Homogentisic acid dioxygenase
C. Alanine transaminase
D. Glutamine amidotransferase

正確答案：B. Homogentisic acid dioxygenase